下列何者不屬於amphetamine的禁斷現象？
A. 渴望獲得藥物（craving for drugs）
B. 疲倦（lassitude）
C. 過食症（hyperphagia）
D. 失眠症（insomnia）

正確答案：D. 失眠症（insomnia）